Clinical trial exclusion criterion:
Any disorder that may interfere with drug absorption

Annotated entities:
- Condition: "disorder"
- Qualifier: "may interfere with drug absorption"